Postmenopausal state revealed by:

The above is a clinical trial inclusion criterion. Annotated with entity spans:
[Parsing_Error: Postmenopausal state revealed by:]